1歲8個月大的幼兒，因大量磚紅色血便求診，病人沒有發燒，沒有腹痛，最可能是下列何種診斷？
A. 腸	疊
B. 沙門氏菌腸炎
C. 美克爾氏憩室出血（Meckel's diverticulum）
D. 肛裂

正確答案：C. 美克爾氏憩室出血（Meckel's diverticulum）